Clinical trial exclusion criterion:
Pregnancy (Self-reported)

Annotated entities:
- Condition: "Pregnancy"
- Non-query-able: "Self-reported"